Adult patients (age = 18)

The above is a clinical trial inclusion criterion. Annotated with entity spans:
[Person: Adult] patients ([Person: age] [Value: = 18])